Signed informed consent form (ICF)

The above is a clinical trial inclusion criterion. Annotated with entity spans:
[Informed_consent: Signed informed consent form (ICF)]